La reacción de 5-Decino con sodio en amoniaco y tert-butanol produce:
1. Decano.
2. cis-5-Deceno.
3. 5-Decanamina.
4. trans-5-Deceno.
5. 5,6-Decanodiamina.

Respuesta correcta: 4. trans-5-Deceno.